Has a history of an infected joint prosthesis, or has received antibiotics for a suspected infection of a joint prosthesis, if that prosthesis has not been removed or replaced

The above is a clinical trial exclusion criterion. Annotated with entity spans:
Has a [Temporal: history] of an [Condition: infected] [Device: joint prosthesis], or has received [Drug: antibiotics] for a [Mood: suspected] [Condition: infection] of a [Device: joint prosthesis], if that prosthesis has not been removed or replaced